一位 81 歲男性，肺癌末期合併多處轉移病人，因疼痛及呼吸困難而入住安寧病房，有關癌症末期病人之疼痛控制，下列敘述何者正確？
A. 對於癌症末期病人應該於疼痛時才給藥，以免造成藥物成癮
B. 對於癌症末期病人之疼痛處理給與嗎啡時，儘量減低劑量，以免呼吸速率減慢
C. 對於神經受損所引起之疼痛及燒灼感，可於使用嗎啡止痛外加上三環抗鬱劑或抗癲癇藥物（如
D. 若病人已呈木僵（stupor）或昏迷，應立即停止給與所有嗎啡藥物以防止嗎啡中毒

正確答案：C. 對於神經受損所引起之疼痛及燒灼感，可於使用嗎啡止痛外加上三環抗鬱劑或抗癲癇藥物（如